下列敘述中，何者錯誤？
A. 大腸纖毛蟲（Balantidium coli）及梨形鞭毛蟲（Giardia lamblia）之滋養體（trophozoites）都具有兩個細胞核
B. 目前治療陰道滴蟲症（vaginal trichomoniasis）的首選用藥為metronidazole
C. 自來水廠之過濾及一般氯處理殺菌方式，即可移除及殺死水中隱胞子蟲（Cryptosporidium spp.）的卵囊
D. 野外露營如果無法煮沸飲水，可利用碘液處理方式殺死水中梨形鞭毛蟲（Giardia lamblia）的囊體

正確答案：C. 自來水廠之過濾及一般氯處理殺菌方式，即可移除及殺死水中隱胞子蟲（Cryptosporidium spp.）的卵囊